一自然產嬰兒出生後第二天被發現於頭皮頂骨（parietal）區有一乒乓球大小的腫塊，邊緣清楚、並且未超越骨縫。請問最可能的診斷是：
A. 胎頭腫塊（caput succedaneum）
B. 頭血腫（cephalohematoma）
C. 帽狀腱膜下血腫（subgaleal hematoma）
D. 腦脊髓膜膨出（meningocele）

正確答案：B. 頭血腫（cephalohematoma）